下列致病原與其導致疾病之配對中，何者正確？
A. 微小阿米巴（Endolimax nana）－腹瀉（diarrhea）
B. 大腸纖毛蟲（Balantidium coli）－赤痢（dysentery）
C. 福氏內格里阿米巴（Naegleria fowleri）－阿米巴肉芽腫性腦炎（granulomatous amebic encephalitis）
D. 波列基阿米巴（Entamoeba polecki）－肝膿瘍（amebic liver abscess）

正確答案：B. 大腸纖毛蟲（Balantidium coli）－赤痢（dysentery）